Clinical trial exclusion criterion:
Elevated liver enzyme (aspartate transaminase (AST)/ alanine transaminase(ALT) level are more than twice normal range) , history of liver cirrhosis, impaired liver function(elevated total bilirubin level) and coagulopathy (including long-term use anticoagulant)

Entity relations:
- Has_value("liver enzyme", "Elevated")
- Has_value("aspartate transaminase (AST)/ alanine transaminase(ALT) level", "more than twice normal range")
- Has_value("total bilirubin level", "elevated")
- Has_multiplier("anticoagulant", "long-term use")